Clinical trial inclusion criterion:
Presentation of moderate to severe depressive symptoms (Montgomery-Asberg Rating Scale: MADRS = 18 at time of study entry or = 24 at any time during study)

Annotated entities:
- Qualifier: "moderate to severe"
- Condition: "depressive symptoms"
- Measurement: "Montgomery-Asberg Rating Scale"
- Measurement: "MADRS"
- Value: "= 18"
- Temporal: "at time of study entry"
- Value: "= 24"
- Temporal: "at any time during study"